骨盆入口（pelvic inlet）骨折最容易傷及下列何者？
A. 髂骨嵴（iliac crest）
B. 恥骨梳（pecten pubis）
C. 髂骨前下棘（anterior inferior iliac spine）
D. 坐骨棘（ischial spine）

正確答案：B. 恥骨梳（pecten pubis）